Patient is not medically fit to undergo the LIFT procedure as judged by the treating physician

The above is a clinical trial exclusion criterion. Annotated with entity spans:
[Subjective_judgement: Patient is not medically fit to undergo the LIFT procedure as judged by the treating physician]